Which are the mammalian orthologs of Drosophila Yki?

There are two mammalian orthologs of Yki: YAP and TAZ